Residual alveolar width = 4 mm (Milinkovic and Cordaro, 2014), residual alveolar height >8 mm, enough inter-arch space for a crown (at least 5 mm) and a minimum distance of 7 mm from the adjacent teeth (Shah and Lum, 2008). The width and height will be confirmed after x-ray examination in Visit 2.

The above is a clinical trial inclusion criterion. Annotated with entity spans:
[Measurement: Residual alveolar width] [Value: = 4 mm] (Milinkovic and Cordaro, 2014), [Measurement: residual alveolar height] [Value: >8 mm], [Non-query-able: enough inter-arch space for a crown (at least 5 mm) and a minimum distance of 7 mm from the adjacent teeth (Shah and Lum, 2008). The width and height will be confirmed after x-ray examination in Visit 2].